Clinical trial exclusion criterion:
13. Subject has active sepsis.

Entity relations:
- Has_temporal("sepsis", "active")